The subject must be willingly and able to provide written informed consent

The above is a clinical trial inclusion criterion. Annotated with entity spans:
[Post-eligibility: The subject must be willingly and able to provide written informed consent]